Clinical trial exclusion criteria:
Currently dependent on any substance other than cannabis, alcohol or nicotine;
History of any major internal disease (including diabetes, cardiovascular disease, lung disease, liver or kidney disease);
An active or any history of neurological disorder, including but not limited to seizure disorder, epilepsy, stroke, neurological disease, cognitive impairment, head trauma with prolonged loss of consciousness (>10 minutes), or migraine headaches;
An active or a history of a psychiatric disorder including, but not limited to, depression, schizophrenia, bipolar disorder, anxiety, or other psychiatric disorders;
Asthma;
Known hypersensitivity or allergy to n-acetylcysteine, or receiving chronic therapy with medication that could interact adversely with n-acetylcysteine within 30 days prior to randomization (i.e., nitroglycerin, ACE inhibitors or antihypertensive drugs, anti-coagulants);
Exclusion criteria for MRI: having metal in the body and/or having claustrophobia

Annotated entities:
- Condition: "dependent"
- Drug: "substance"
- Negation: "other than"
- Drug: "cannabis"
- Drug: "alcohol"
- Drug: "nicotine"
- Condition: "major internal disease"
- Condition: "diabetes"
- Condition: "cardiovascular disease"
- Condition: "lung disease"
- Condition: "kidney disease"
- Condition: "liver disease"
- Condition: "neurological disorder"
- Temporal: "history"
- Qualifier: "active"
- Condition: "seizure disorder"
- Condition: "epilepsy"
- Condition: "stroke"
- Condition: "neurological disease"
- Condition: "cognitive impairment"
- Condition: "head trauma"
- Condition: "prolonged loss of consciousness"
- Qualifier: ">10 minutes"
- Condition: "migraine headaches"
- Qualifier: "active"
- Temporal: "history"
- Condition: "psychiatric disorder"
- Condition: "depression"
- Condition: "schizophrenia"
- Condition: "bipolar disorder"
- Condition: "anxiety"
- Condition: "psychiatric disorders"
- Qualifier: "other"
- Condition: "Asthma"
- Condition: "hypersensitivity"
- Condition: "allergy"
- Drug: "n-acetylcysteine"
- Procedure: "chronic therapy"
- Drug: "n-acetylcysteine"
- Temporal: "within 30 days prior to randomization"
- Drug: "nitroglycerin"
- Drug: "ACE inhibitors"
- Drug: "antihypertensive drugs"
- Drug: "anti-coagulants"
- Condition: "Exclusion criteria for MRI"
- Device: "metal in the body"
- Condition: "claustrophobia"